Clinically significant cardiovascular disease (including myocardial infarction, unstable angina, symptomatic congestive heart failure, serious uncontrolled cardiac arrhythmia) <=6 months prior to enrolment.

The above is a clinical trial exclusion criterion. Annotated with entity spans:
[Qualifier: Clinically significant] [Condition: cardiovascular disease] (including [Condition: myocardial infarction], [Condition: unstable angina], [Qualifier: symptomatic] [Condition: congestive heart failure], [Qualifier: serious] [Qualifier: uncontrolled] [Condition: cardiac arrhythmia]) [Temporal: <=6 months prior to enrolment].